Clinical trial exclusion criterion:
Known hypersensitivity or contraindication to any of the following medications: Heparin, aspirin, clopidogrel, sirolimus, siptagliptin and statin

Annotated entities:
- Condition: "hypersensitivity"
- Condition: "contraindication"
- Drug: "Heparin"
- Drug: "aspirin"
- Drug: "clopidogrel"
- Drug: "sirolimus"
- Drug: "siptagliptin"
- Drug: "statin"